Clinical trial exclusion criterion:
Patient is unwilling to discontinue 5-alph reductase inhibitors 1 month after study treatment

Entity relations:
- Has_temporal("5-alph reductase inhibitors", "1 month after study treatment")